Clinical trial inclusion criterion:
ILD criteria: diagnosis of interstitial lung disease with chronic supplemental oxygen requirement at rest and/or with exertion.

Entity relations:
- Has_qualifier("chronic supplemental oxygen requirement", "at rest")
- OR("at rest", "with exertion")